HbA1c :>6.5%

The above is a clinical trial inclusion criterion. Annotated with entity spans:
[Measurement: HbA1c] :[Value: >6.5%]